Clinical trial exclusion criterion:
Incapability to give informed consent

Annotated entities:
- Informed_consent: "Incapability to give informed consent"